¿En qué trastorno de la conducta alimentaria, la personalidad de los pacientes se caracteriza por ser personas impulsivas, con tendencia a tomar decisiones rápidas y actuar de forma impredecible?
1. Anorexia nerviosa de tipo restrictivo.
2. Pica.
3. Obesidad.
4. Bulimia nerviosa.
5. Comedor nocturno.

Respuesta correcta: 4. Bulimia nerviosa.